Clinical trial exclusion criterion:
With severe comorbidities, such as cardiovascular disease, chronic obstructive pulmonary disease, diabetes mellitus, and chronic renal dysfunction.

Annotated entities:
- Condition: "comorbidities"
- Qualifier: "severe"
- Condition: "cardiovascular disease"
- Undefined_semantics: "comorbidities"
- Condition: "chronic obstructive pulmonary disease"
- Condition: "diabetes mellitus"
- Condition: "chronic renal dysfunction"
- Grammar_Error: "and"